Acude a consulta de enfermería una mujer de 48 años, que acaba de ser diagnosticada de Diabetes Mellitus 2. Los valores de glucemia basal venosa son: 165 mg/dl. Otros datos de interés son: colesterol total: 197 mg/dl e IMC 23 Kg/m2. ¿Qué recomendación dietética está indicada?:
1. Distribuir la ingesta de hidratos de carbono a lo largo del día, con una proporción de hidratos de carbono de 30-54%.
2. Planificar junto con la paciente una dieta hipocalórica que incluya el 55-60% de hidratos de carbono, una reducción de la ingesta grasa <30% y el consumo de fibra de 20-30 g.
3. Tomar suplementos de ácidos grasos omega 3.
4. El consumo de alcohol no debe sobrepasar una-dos unidades/día.
5. Elaborar junto con la paciente una dieta hiperproteica, que incluya alimentos de bajo índice glucémico.

Respuesta correcta: 4. El consumo de alcohol no debe sobrepasar una-dos unidades/día.